En las reacciones de eliminación E2 el requisito de alineación periplanar es un ejemplo de control:
1. Estérico.
2. Electrónico.
3. Estereoelectrónico.
4. Regioquímico.

Respuesta correcta: 3. Estereoelectrónico.